一位 36 歲男性工人體重 70 公斤，工作時不慎發生火災，身體表面積有 30%的燒傷，根據 Parkland  formula 計算，他前 8 小時應給予多少毫升的輸液？
A. 8400
B. 6300
C. 4200
D. 2100

正確答案：C. 4200